Acute pulmonary edema.

The above is a clinical trial exclusion criterion. Annotated with entity spans:
[Condition: Acute pulmonary edema].